La condensación aldólica da origen a:
1. Amidas α,β-insaturadas.
2. Amidas saturadas.
3. Compuestos carbonílicos α,β-insaturados.
4. Compuestos quirales.
5. Compuestos carbonílicos β,γ-insaturados.

Respuesta correcta: 3. Compuestos carbonílicos α,β-insaturados.